基底腦膜炎（basilar meningitis）是在腦底形成一層厚厚的纖維性黏連滲出物，鑑別診斷最先要考慮是下列何病症？
A. 結核性腦膜炎
B. 腦膜血管性梅毒
C. 無菌性腦膜炎
D. 嗜伊紅性腦膜炎

正確答案：A. 結核性腦膜炎